Prior trombosis or myocardial infarction, congenital coagulation disorder, use of anti-coagulants prior to surgery, prior thoracic surgery, pregnancy, pre-operative fibrinogen concentration <1g/L

The above is a clinical trial exclusion criterion. Annotated with entity spans:
[Temporal: Prior] [Condition: trombosis] or [Condition: myocardial infarction], [Condition: congenital coagulation disorder], use of [Drug: anti-coagulants] [Temporal: prior to surgery], [Temporal: prior] [Procedure: thoracic surgery], [Condition: pregnancy], [Temporal: pre-operative] [Measurement: fibrinogen concentration] [Value: <1g/L]